Señale cuál de los siguientes síntomas constituye, más propiamente, una alteración del pensamiento:
1. La alogia.
2. La abulia-apatía.
3. La anhedonia.
4. El aplanamiento afectivo.

Respuesta correcta: 1. La alogia.